Regular use of narcotic analgesics (>2 doses per week).

The above is a clinical trial exclusion criterion. Annotated with entity spans:
[Multiplier: Regular use] of [Drug: narcotic analgesics] ([Multiplier: >2 doses per week]).